有關腦下垂體瘤（pituitary adenoma）的敘述，下列何者錯誤？
A. 腦下垂體瘤大於 1 公分時，雖經常有頸靜脈竇的侵襲（cavernous sinus invasion），但很少見第三至第六顱神經的缺損
B. 腦下垂體瘤病患經常有尿崩（diabetes insipidus）症狀
C. 泌乳激素（prolactin）輕微的上升，不一定是泌乳激素瘤（prolactinoma）所引起，而可能是因為 pituitary stalk 被大的腺瘤壓迫所引起
D. 口服 dopamine agonist 如 bromocriptine，可使 80%泌乳激素瘤（prolactinoma）縮小

正確答案：B. 腦下垂體瘤病患經常有尿崩（diabetes insipidus）症狀